關於傳染性蛋白質（prion）所引起之疾病的敘述，下列何者錯誤？
A. 潛伏期很長
B. 會引起激烈的免疫反應
C. 可經由眼角膜移植傳染
D. 病人常會有失智（dementia）症狀

正確答案：B. 會引起激烈的免疫反應